Clinical trial exclusion criterion:
HIV+ patients

Entity relations:
- Has_value("HIV", "+")
- multi("HIV+", "HIV")